Metal plate in skull

The above is a clinical trial exclusion criterion. Annotated with entity spans:
[Device: Metal plate in skull]